Clinical trial exclusion criterion:
Untreated phaeochromocytoma.

Entity relations:
- Has_qualifier("phaeochromocytoma", "Untreated")